一位 15 歲的女生，三年前開始有月經，最近被診斷是青春期特發性脊椎側彎（adolescent idiopathic scoliosis），側彎度數為 22 度，Risser sign 為 4，目前最適當的治療是：
A. 手術治療（surgery）
B. 背架治療（brace）
C. 觀察（observation）
D. 電刺激治療

正確答案：C. 觀察（observation）